Clinical trial inclusion criteria:
Male
Age between 18 and 49 years old;
Willing to provide name, address, telephone and other contact information in order to be contacted, whenever needed (example: in case of missing any scheduled visit, contact for confirmation of scheduling a visit, urgent safety notifications);
Willing to strictly follow the study protocol;
Capacity for understanding and signing in the Informed Consent Form;
To understand the impossibility of participating in another clinical trial during the time of participation in the study, until 6 months after its conclusion;
Intellectual level which allows to filling in the diaries for registering of symptoms at home;
Willing to undergo to serological testing to HIV, HBV and HCV;
Being in good health, with no significant medical history;
Physical examination at screening period without clinically significant changes;
Lab examination at screening period within the normal ranges, determined by the laboratory or abnormal values, grading below 1 or 2, according to medical decision.

Annotated entities:
- Person: "Male"
- Person: "Age"
- Value: "between 18 and 49 years old"
- Non-query-able: "Willing to provide name, address, telephone and other contact information in order to be contacted, whenever needed (example: in case of missing any scheduled visit, contact for confirmation of scheduling a visit, urgent safety notifications);"
- Post-eligibility: "Willing to provide name, address, telephone and other contact information in order to be contacted, whenever needed (example: in case of missing any scheduled visit, contact for confirmation of scheduling a visit, urgent safety notifications);"
- Non-query-able: "Willing to strictly follow the study protocol;"
- Post-eligibility: "Willing to strictly follow the study protocol;"
- Post-eligibility: "Capacity for understanding and signing in the Informed Consent Form;"
- Non-query-able: "Capacity for understanding and signing in the Informed Consent Form;"
- Non-query-able: "To understand the impossibility of participating in another clinical trial during the time of participation in the study, until 6 months after its conclusion;"
- Post-eligibility: "To understand the impossibility of participating in another clinical trial during the time of participation in the study, until 6 months after its conclusion;"
- Undefined_semantics: "Intellectual level which allows to filling in the diaries for registering of symptoms at home;"
- Post-eligibility: "Intellectual level which allows to filling in the diaries for registering of symptoms at home;"
- Non-query-able: "Intellectual level which allows to filling in the diaries for registering of symptoms at home;"
- Procedure: "serological testing to HIV"
- Procedure: "serological testing to HBV"
- Procedure: "serological testing to HCV"
- Non-query-able: "Willing to undergo to serological testing to HIV, HBV and HCV;"
- Post-eligibility: "Willing to undergo to serological testing to HIV, HBV and HCV;"
- Condition: "good health"
- Undefined_semantics: "good health"
- Subjective_judgement: "Being in good health, with no significant medical history;"
- Procedure: "Physical examination"
- Temporal: "at screening period"
- Reference_point: "screening period"
- Undefined_semantics: "Physical examination at screening period without clinically significant changes;"
- Subjective_judgement: "Physical examination at screening period without clinically significant changes;"
- Subjective_judgement: "Lab examination at screening period within the normal ranges, determined by the laboratory or abnormal values, grading below 1 or 2, according to medical decision."
- Post-eligibility: "Lab examination at screening period within the normal ranges, determined by the laboratory or abnormal values, grading below 1 or 2, according to medical decision."